Clinical trial exclusion criterion:
Active or recent history (= 1 year) of drug or alcohol abuse

Annotated entities:
- Observation: "alcohol abuse"
- Observation: "drug abuse"
- Temporal: "= 1 year"